El llenado ventricular es mayor durante:
1. Relajación isovolumétrica ventricular.
2. Primer tercio de la diástole ventricular.
3. Sístole auricular.
4. Fase intermedia de la diástole ventricular.
5. Es uniforme.

Respuesta correcta: 2. Primer tercio de la diástole ventricular.